Recent catheter insertion at beginning of the study.

The above is a clinical trial inclusion criterion. Annotated with entity spans:
[Temporal: Recent] [Procedure: catheter insertion] [Temporal: at beginning of the study].